Clinical trial inclusion criterion:
Undergoing major cardiac surgery using cardiopulmonary bypass

Annotated entities:
- Procedure: "major cardiac surgery"
- Procedure: "cardiopulmonary bypass"